Clinical trial exclusion criterion:
previous transfusion of blood products

Entity relations:
- Has_temporal("transfusion of blood products", "previous")